Clinical trial inclusion criterion:
Women of childbearing age had to use a proven method to prevent pregnancy, before the surgical treatment.

Entity relations:
- Has_index("before the surgical treatment", "the surgical treatment")
- AND("the surgical treatment", "surgical treatment")
- Has_temporal("method to prevent pregnancy", "before the surgical treatment")
- Has_context("childbearing age", "method to prevent pregnancy")
- Has_context("Women", "method to prevent pregnancy")